Clinical trial exclusion criterion:
BMI <18 and> 35 kg / m2

Entity relations:
- Has_value("BMI", "<18 and> 35 kg / m2")